Clinical trial exclusion criterion:
Active hemorrhage or increased risk of bleeding due to impairment of homeostasis.

Entity relations:
- Has_qualifier("risk of bleeding", "increased")
- AND("risk of bleeding", "impairment of homeostasis")
- OR("Active hemorrhage", "risk of bleeding")